Clinical trial exclusion criterion:
Liver enzymes greater than 2 times ULN.

Annotated entities:
- Measurement: "Liver enzymes"
- Value: "greater than 2 times ULN"